Clinical trial exclusion criterion:
Patients with an allergy to oral vancomycin or fidaxomicin.

Annotated entities:
- Condition: "allergy"
- Drug: "vancomycin"
- Drug: "fidaxomicin"
- Qualifier: "oral"